Clinical trial exclusion criterion:
Presence of conditions such as preeclampsia, multiparity, preterm labor

Annotated entities:
- Condition: "preeclampsia"
- Condition: "multiparity"
- Condition: "preterm labor"